有關足底筋膜炎（plantar fasciitis）及其治療的敘述，何者錯誤？
A. 病患常抱怨早晨第一步踏下去時最疼痛
B. 病灶常在足底筋膜接跟骨處
C. 當晚上使用足踝部護具（AFO）時，必須將踝關節固定在最大蹠屈（plantar flexion）角度
D. 有證據顯示，體外震波治療（extracorporeal shockwave therapy）可有效治療足底筋膜炎

正確答案：C. 當晚上使用足踝部護具（AFO）時，必須將踝關節固定在最大蹠屈（plantar flexion）角度